Clinical trial exclusion criterion:
7. BUN or creatine above the normal limits.

Annotated entities:
- Measurement: "BUN"
- Measurement: "creatine"
- Value: "above the normal limits"